下列何者連接前庭神經核（vestibular nucleus）與控制眼球運動之神經核？
A. vestibulocerebellar fiber
B. central tegmental tract
C. medial longitudinal fasciculus
D. medial forebrain bundle

正確答案：C. medial longitudinal fasciculus